Any therapy by intra-articular injections (e.g. corticosteroid) within 4 weeks before baseline

The above is a clinical trial inclusion criterion. Annotated with entity spans:
Any therapy by [Procedure: intra-articular injections] (e.g. [Drug: corticosteroid]) [Temporal: within 4 weeks before baseline]